一對夫妻兩人MCV及MCH值都明顯偏低。血紅素電泳檢查顯示先生HbA2為 5.1 %，妻子HbA2為 4.2 %，因為妻子懷孕 27 週才發現夫妻同為海洋型貧血（thalassemia）帶因者，夫妻及胎兒均來不及接受基因檢驗。妻子在懷孕 37 週時自然生產下一男嬰，嬰兒出生時外觀及活動力正常，Apgar score 9→10，三個月大時血紅素電泳檢查顯示HbF 82%，該新生兒最可能罹患：
A. α-thalassemia minor
B. α-thalassemia major
C. β-thalassemia minor
D. β-thalassemia major

正確答案：D. β-thalassemia major